Currently taking more than three glucose lowering therapies

The above is a clinical trial exclusion criterion. Annotated with entity spans:
Currently taking [Multiplier: more than three] [Procedure: glucose lowering therapies]